下列何者是心臟 excitation-contraction coupling 的重要媒介物？
A. 鈣離子
B. 鈉離子
C. 鉀離子
D. 氯離子

正確答案：A. 鈣離子